Hormone therapy < 7 days prior to randomization.

The above is a clinical trial exclusion criterion. Annotated with entity spans:
[Procedure: Hormone therapy] [Temporal: < 7 days prior to randomization].